Clinical trial exclusion criterion:
2. Researchers think that Patients with disease may be interference results(e.g., Spinal deformity, spine fracture, ankylosing spondylitis, spinal tuberculosis and spinal infection, spinal tumor, pelvic inflammatory disease and other disease of department of gynaecology, etc)

Annotated entities:
- Condition: "Spinal deformity"
- Condition: "spine fracture,"
- Condition: "ankylosing spondylitis"
- Condition: "spinal tuberculosis"
- Condition: "spinal infection"
- Condition: "spinal tumor"
- Condition: "pelvic inflammatory disease"